¿Cuál de estos componentes no es frecuente en las terapias cognitivo-conductuales para el trastorno de pánico?:
1. Activación conductual.
2. Exposición interoceptiva.
3. Experimentos conductuales.
4. Entrenamiento en respiración.
5. Reestructuración cognitiva.

Respuesta correcta: 1. Activación conductual.